70歲男性糖尿病人需接受小腸惡性腫瘤切除手術，應採取什麼措施來預防手術部位感染（surgical site infections）？
A. 在手術切開皮膚之後給予抗生素
B. 控制其血糖在200〜250 mg/dL
C. 手術中將病人體溫維持在35.5〜36℃
D. 手術時間超過使用之抗生素的半生期（half life）2倍長時，追加一次抗生素

正確答案：D. 手術時間超過使用之抗生素的半生期（half life）2倍長時，追加一次抗生素